下列敘述，何者錯誤？
A. 副甲狀腺機能亢進（hyperparathyroidism）是高鈣血症（hypercalcemia）的一個常見原因
B. 腫瘤溶解症候群（tumor lysis syndrome）會造成高鈣血症
C. 休克病人治療復甦後會有急性低鈣血症（hypocalcemia）的情形
D. 以靜脈鈣輸液治療低鈣血症，而病人有服用毛地黃時，輸液速率不可太快以免引起心律失常

正確答案：B. 腫瘤溶解症候群（tumor lysis syndrome）會造成高鈣血症